一位 40 歲中年人，突發局部腦癲癇發作，局部痙攣由單側下肢開始再轉成大發作昏厥，電腦斷層顯示一邊緣清楚之腦瘤，且注射顯影劑後呈現明顯且均勻之染色增強，而腦血管攝影則出現腦瘤之供應血管來自中硬腦膜動脈。下列四項腦瘤中，那一項為最佳診斷？
A. 顱咽瘤（craniopharyngioma）
B. 多形性膠質母細胞瘤（glioblastoma multiforme）
C. 矢狀竇旁腦膜瘤（parasagittal meningioma）
D. 聽神經瘤（acoustic neuroma）

正確答案：C. 矢狀竇旁腦膜瘤（parasagittal meningioma）